Clinical trial exclusion criterion:
Thrombosis extending into the porta(thrombosis of one of left or right branch authorized), extra hepatic metastasis

Annotated entities:
- Condition: "Thrombosis"
- Qualifier: "extending into the porta"
- Condition: "thrombosis"
- Qualifier: "left branch"
- Qualifier: "right branch"
- Grammar_Error: "authorized"
- Negation: "authorized"
- Condition: "extra hepatic metastasis"